Regular use of anti-inflammatory drugs.

The above is a clinical trial exclusion criterion. Annotated with entity spans:
Regular use of [Drug: anti-inflammatory drugs].